Clinical trial inclusion criterion:
Negative for HBsAg and for antibodies to HCV, HIV-1.

Entity relations:
- Has_value("HBsAg", "Negative")
- Has_value("antibodies to HCV", "Negative")
- Has_value("HIV-1", "Negative")